Clinical trial exclusion criterion:
Women who received metallic fixation, coronary artery stent in recent 3 months; or women who received mechanical valve replacement that is not compatible with MR magnet; or women with aneurysmal clips, pacemakers.

Entity relations:
- AND("women", "aneurysmal clips")
- AND("women", "mechanical valve replacement")
- Has_temporal("metallic fixation", "recent 3 months")
- AND("Women", "metallic fixation")
- OR("aneurysmal clips", "pacemakers")
- OR("Women", "women", "women")
- OR("metallic fixation", "coronary artery stent")